Clinical trial exclusion criterion:
Vaccination within 30 days prior to the first dose administration or has plans to receive a vaccination during the course of the study (including the follow phone call on Day 105).

Entity relations:
- Has_index("during the course", "study")
- Has_index("within 30 days prior", "the first dose administration")
- Has_temporal("Vaccination", "within 30 days prior")
- Has_mood("vaccination", "plans")
- Has_temporal("vaccination", "during the course")
- OR("Vaccination", "vaccination")